any neurological conditions other than PD;

The above is a clinical trial exclusion criterion. Annotated with entity spans:
any [Condition: neurological conditions] [Negation: other than] [Condition: PD];